Clinical trial inclusion criterion:
Vestibular schwannoma advised to surgical treatment

Annotated entities:
- Condition: "Vestibular schwannoma"
- Mood: "advised"
- Procedure: "surgical treatment"